Clinical trial exclusion criterion:
Ongoing therapy with any of the following: Systemic corticosteroids. Short course less than or equal to 21 days of corticosteroids is allowed; Systemic chemotherapeutic agents; Nephrotoxic systemic agents, including aminoglycosides, amphotericin B, cidofovir, cisplatin, foscarnet, pentamidine; Immunomodulatory treatments including Interleukin-2; Investigational agents

Entity relations:
- Has_temporal("therapy", "Ongoing")
- Subsumes("Short course", "less than or equal to 21 days")
- Has_multiplier("corticosteroids", "Short course")
- Has_negation("corticosteroids", "is allowed")
- Subsumes("Immunomodulatory treatments", "Interleukin-2")
- AND("Systemic corticosteroids", "corticosteroids")
- AND("therapy", "Systemic corticosteroids")
- OR("Systemic corticosteroids", "amphotericin B", "cidofovir", "cisplatin", "foscarnet", "pentamidine", "Immunomodulatory treatments", "Investigational agents", "Nephrotoxic systemic agents", "Systemic chemotherapeutic agents", "aminoglycosides")